NA

The above is a clinical trial inclusion criterion. Annotated with entity spans:
[Non-query-able: NA]